El señor P. L. de 59 años, tiene diabetes de tipo 2 y su Índice de Masa Corporal es de 27. Le pregunta a usted si puede tomar una copa de vino con las comidas. Su respuesta es:
1. Debe abstenerse de ingerir bebidas alcohólicas por el riesgo de desarrollar cetoacidosis.
2. Puede hacerlo, pero debe incorporar las calorías del alcohol al plan de alimentación.
3. Puede consumirlo antes de las comidas para reducir el riesgo de hipoglucemia.
4. Debe evitarlo, pues el consumo de alcohol aunque sea en cantidades moderadas aumenta la morbilidad coronaria.
5. Ninguna respuesta es correcta.

Respuesta correcta: 2. Puede hacerlo, pero debe incorporar las calorías del alcohol al plan de alimentación.